Confirmed idiopathic pulmonary hypertension, connective tissue disease associated pulmonary hypertension, congenital heart disease(with Eisenmenger syndrome) associated pulmonary hypertension.

The above is a clinical trial inclusion criterion. Annotated with entity spans:
Confirmed [Condition: idiopathic pulmonary hypertension], [Qualifier: connective tissue disease associated] [Condition: pulmonary hypertension], [Qualifier: congenital heart disease](with [Condition: Eisenmenger syndrome]) associated [Condition: pulmonary hypertension].